Inflammatory bowel disease.

The above is a clinical trial exclusion criterion. Annotated with entity spans:
[Condition: Inflammatory bowel disease].